Clinical trial exclusion criterion:
supraventricular rhythm disorder

Annotated entities:
- Condition: "supraventricular rhythm disorder"